Clinical trial exclusion criterion:
elevated risk for volume depletion, e.g. history of severe volume depletion that required medical therapy

Entity relations:
- Has_qualifier("risk for volume depletion,", "elevated")